Symptomatic: Baseline Dyspnea Index =8 and answer "in the morning" when asked about what time of day their COPD symptoms are worst.

The above is a clinical trial inclusion criterion. Annotated with entity spans:
Symptomatic: [Measurement: Baseline Dyspnea Index] [Value: =8] and answer "[Value: in the morning]" when asked about [Observation: what time of day their COPD symptoms are worst].